Expected life expectancy < 1 year

The above is a clinical trial exclusion criterion. Annotated with entity spans:
[Observation: Expected life expectancy] [Value: < 1 year]